安排病人手術前，需要跟病人詳細說明手術的內容及其效益風險，確認病人了解及同意後，再請病人簽署手術知情同意書（informed consent），這種的作法是在確保：
A. 尊重自主原則（respect for autonomy）
B. 行善原則（beneficence）
C. 不傷害原則（non-maleficence）
D. 正義原則（justice）

正確答案：A. 尊重自主原則（respect for autonomy）